Clinical trial inclusion criterion:
Current use of a psychotropic nutraceutical (e.g. St John's wort)

Annotated entities:
- Drug: "psychotropic nutraceutical"
- Condition: "St John's wort"
- Temporal: "Current"
- Procedure: "use"